Señale la respuesta correcta. Respecto a la Cartera de Servicios Estandarizada de Atención Primaria del Sistema Nacional de Salud (SNS):
1. Entre sus elementos fundamentales se encuentra la base poblacional sin identificación de la población diana.
2. Es el conjunto de actividades, técnicas, procedimientos que funcionan como guía de máximos a realizar por parte de una enfermera en la Atención Primaria.
3. Es el catálogo de prestaciones, construido como la selección de servicios priorizada, en función de necesidades y demandas de la población, y con una organización específica para la prestación de los servicios.
4. Es el conjunto de criterios de calidad de la atención sanitaria, que se caracterizan por ser objetivables, fácilmente medibles, evaluables y verificables, y basados en el consenso de expertos.

Respuesta correcta: 3. Es el catálogo de prestaciones, construido como la selección de servicios priorizada, en función de necesidades y demandas de la población, y con una organización específica para la prestación de los servicios.